Neutrophil count < 0.5 x 109 cells/L.

The above is a clinical trial exclusion criterion. Annotated with entity spans:
[Measurement: Neutrophil count] [Value: < 0.5 x 109 cells/L].